Medication No use within the following time intervals prior to Screening or thereafter at any time during the study (unless otherwise specified) Inhaled Long acting beta-agonists (LABA) 48 hours ICS/LABA combination products 48 hours Inhaled corticosteroids 48 hours Tiotropium 1 week Systemic, Oral, parenteral, intra-articular corticosteroids 30 days (oral and systemic corticosteroids may be used to treat COPD exacerbations during the study) Cytochrome P450 3A4 strong inhibitors including but not limited to antiretrovirals (protease inhibitors) (e.g.Indinavir, Nelfinavir, Ritonavir, Saquinavir); Imidazole and Triazole anti-fungals (e.g. Ketaconazole, Itraconazole); Clarithromycin, Telithromycin, Amiodarone, and Nefazodone 6 weeks Grapefruit is allowed up to Visit 1, then limited to no more than one glass of grapefruit juice (250 mL/ 8 ounces) or one grapefruit per day Any other investigational drug 30 days or 5 half lives whichever is longer.

The above is a clinical trial exclusion criterion. Annotated with entity spans:
Medication [Negation: No] use within the following time intervals prior to [Reference_point: Screening] or thereafter at [Reference_point: any time during the study] (unless otherwise specified) [Drug: Inhaled Long acting beta-agonists (LABA)] [Temporal: 48 hours] [Drug: ICS/LABA combination products] [Temporal: 48 hours] [Drug: Inhaled corticosteroids] [Temporal: 48 hours] [Drug: Tiotropium] [Temporal: 1 week] [Qualifier: Systemic], [Qualifier: Oral], [Qualifier: parenteral], [Qualifier: intra-articular] [Drug: corticosteroids] [Temporal: 30 days] ([Not_a_criteria: oral and systemic corticosteroids may be used to treat COPD exacerbations during the study]) [Drug: Cytochrome P450 3A4 strong inhibitors] including but not limited to [Drug: antiretrovirals] ([Drug: protease inhibitors]) (e.g.[Drug: Indinavir], [Drug: Nelfinavir], [Drug: Ritonavir], [Drug: Saquinavir]); [Drug: Imidazole] and [Drug: Triazole anti-fungals] (e.g. [Drug: Ketaconazole], [Drug: Itraconazole]); [Drug: Clarithromycin], [Drug: Telithromycin], [Drug: Amiodarone], and [Drug: Nefazodone] [Temporal: 6 weeks] [Grammar_Error: Grapefruit is allowed up to Visit 1], then limited to no more than one glass of grapefruit juice (250 mL/ 8 ounces) or one grapefruit per day Any other [Drug: investigational drug] [Temporal: 30 days] or [Temporal: 5 half lives] whichever is longer.